長期臥床會造成各種身體器官產生失動症候群（immobilization syndrome）。下列何者不屬於其中症狀？
A. 休息心跳率減低
B. 廢用性肌肉萎縮
C. 骨質密度下降
D. 沈積性肺炎（hypostatic pneumonia）

正確答案：A. 休息心跳率減低